Clinical trial exclusion criterion:
Prior treatment with more than 2 cycles of carboplating-based chemotherapy regimens

Entity relations:
- Has_qualifier("chemotherapy regimens", "carboplating-based")
- AND("more than 2 cycles", "chemotherapy regimens")
- Subsumes("chemotherapy regimens", "treatment")
- Has_temporal("chemotherapy regimens", "Prior")